Hepatocellular carcinoma after liver transplantation.

The above is a clinical trial exclusion criterion. Annotated with entity spans:
[Condition: Hepatocellular carcinoma] [Temporal: after liver transplantation].